Clinical trial exclusion criteria:
day 3 transfers

Annotated entities:
- Non-query-able: "day 3 transfers"